下列那種免疫細胞在正常人類血液中最不常見？
A. 嗜酸性球（eosinophil）
B. 淋巴球（lymphocyte）
C. 單核球（monocyte）
D. 肥大細胞（mast cell）

正確答案：D. 肥大細胞（mast cell）